Do archaeal genomes contain one or multiple origins of replication?

Some archaea replicate from single origins but most archaea and all eukaryotes replicate using multiple origins.